Clinical trial exclusion criterion:
Has received a live vaccine within 30 days prior to the first dose of study therapy

Entity relations:
- Has_index("30 days prior", "first dose of study therapy")
- Has_temporal("live vaccine", "30 days prior")